下列有關「自體抗體與風濕病疾病之間的關係」的組合中，何者最具有特異性？
A. rheumatoid factors - Sjögren's syndrome
B. anti-Scl 70 antibodies - mixed connective tissue disease
C. anti-histone antibodies - systemic lupus erythematosus
D. anti-CCP antibodies - rheumatoid arthritis

正確答案：D. anti-CCP antibodies - rheumatoid arthritis